Amalia, presidenta de la asociación de vecinos de la zona del centro de salud donde trabaja, comenta la percepción de excesivos agentes estresantes en su barrio, con un aumento de los problemas sociales y excesivos conflictos comunitarios. Además le pone de manifiesto que no hay apenas resolución de estos problemas por parte de los agentes responsables. Lamentándose asegura que, desde hace un tiempo, los sistemas comunitarios son ineficaces. ¿Qué diagnostico NANDA Internacional de los siguientes presenta la comunidad donde vive Amalia?:
1. Afrontamiento ineficaz de la comunidad.
2. Manejo ineficaz del régimen terapéutico de la comunidad.
3. Disposición para mejorar el afrontamiento de la comunidad.
4. Negación ineficaz de la comunidad.

Respuesta correcta: 1. Afrontamiento ineficaz de la comunidad.